What is the mode of inheritance of Romano Ward long QT syndrome?

The Romano Ward long QT syndrome (LQTS) has an autosomal dominant mode of inheritance.